Clinical trial exclusion criterion:
Known or suspected alcohol or substance abuse in the preceding 12 months.

Annotated entities:
- Condition: "substance abuse"
- Condition: "alcohol abuse"
- Temporal: "preceding 12 months"